Clinical trial inclusion criterion:
adults capable of providing consent

Annotated entities:
- Person: "adults"
- Informed_consent: "capable of providing consent"